那一種新生兒的 reflex 的消失才能使嬰兒有翻身動作的發展完成？
A. Moro reflex
B. Parachute reflex
C. Rooting reflex
D. Tonic neck reflex

正確答案：D. Tonic neck reflex